Clinical trial inclusion criterion:
Patients who are able to perform SD-OCT

Annotated entities:
- Mood: "able to perform"
- Procedure: "SD-OCT"